patients with immunodeficiency and malignant tumors during the treatment period, receiving immunosuppressive therapy (oral steroid) or HIV due to low immunity, or family members have congenital immune disease

The above is a clinical trial exclusion criterion. Annotated with entity spans:
patients with [Condition: immunodeficiency] and [Condition: malignant tumors] [Temporal: during the treatment period], receiving [Procedure: immunosuppressive therapy] ([Drug: oral steroid]) or [Condition: HIV] due to low immunity, or [Observation: family members] have [Condition: congenital immune disease]